Señale la afirmación FALSA respecto de la sarcoidosis:
1. La presencia de infiltrados parenquimatosos sin afectación hiliar en la sarcoidosis pulmonar indican un estadio III.
2. El método más sensible para detectar enfermedad pulmonar intersticial en la sarcoidosis es la medición de la capacidad de difusión del CO (DLCO).
3. Un aumento del número de linfocitos totales en el lavado broncoalveolar (BAL) así como un cociente CD4/CD8 inferior a 3.5 en el lavado broncalveolar es altamente sugestivo de sarcoidosis.
4. La elevación de la enzima de conversión de angiotensina en sangre por encima de 2 veces su valor normal es congruente con el diagnóstico de sarcoidosis, si bien su sensibilidad y especificidad son bajas.

Respuesta correcta: 3. Un aumento del número de linfocitos totales en el lavado broncoalveolar (BAL) así como un cociente CD4/CD8 inferior a 3.5 en el lavado broncalveolar es altamente sugestivo de sarcoidosis.